Clinical trial exclusion criterion:
Current participation in another clinical study.

Annotated entities:
- Non-query-able: "Current participation in another clinical study."